Clinical trial inclusion criterion:
= 21 years of age at the time of participation.

Entity relations:
- Has_index("at the time of participation", "participation")
- Has_value("age", "= 21 years")
- Has_temporal("age", "at the time of participation")